Fluent in reading and writing in English language.

The above is a clinical trial inclusion criterion. Annotated with entity spans:
[Non-query-able: Fluent in reading and writing in English language.]